Major surgery (e.g., requiring general anesthesia) <=30 days before first dose of study treatment. Subjects must have recovered from any surgery related toxicities.

The above is a clinical trial exclusion criterion. Annotated with entity spans:
[Procedure: Major surgery] (e.g., requiring [Procedure: general anesthesia]) [Temporal: <=30 days before first dose of study treatment]. [Non-query-able: Subjects must have recovered from any surgery related toxicities.]